Clinical trial exclusion criterion:
Fistula with multiple tracts

Annotated entities:
- Condition: "Fistula"
- Qualifier: "multiple tracts"